Clinical trial exclusion criterion:
Hypertension with pregnancy.

Entity relations:
- AND("Hypertension", "pregnancy")